Clinical trial exclusion criterion:
TBS with major arterial bleeding requiring suture or mechanical ligation;

Entity relations:
- AND("TBS", "major arterial bleeding")
- AND("major arterial bleeding", "suture")
- OR("suture", "mechanical ligation")